What does iBAQ stand for in proteomic analysis?

iBAQ stands for intensity-based absolute quantification.